Current use of medication that may affect voiding (ie- anticholinergics)

The above is a clinical trial exclusion criterion. Annotated with entity spans:
[Temporal: Current] use of [Drug: medication] that may [Condition: affect voiding] (ie- [Drug: anticholinergics])